在生產過程中，從母親傳給嬰兒的肝炎病毒，下列何者最常見？
A. A型
B. B型
C. C型
D. D型

正確答案：B. B型